Clinical trial exclusion criterion:
Patients with positive HIV status

Entity relations:
- Has_value("HIV status", "positive")